Clinical trial exclusion criterion:
24. Hepatic dysfunction as defined by Child-Pugh Class B or C

Entity relations:
- Has_value("Child-Pugh", "Class B or C")
- AND("Hepatic dysfunction", "Child-Pugh")